一位 65 歲男性，B 型肝炎帶原者，因被診斷為肝硬化求診，為徹底了解病因，進一步做肝炎病毒檢查。 以下那一項檢查針對肝硬化的病因診斷是沒有幫助的？
A. Anti-HAV
B. Anti-HBV e antigen
C. Anti-HCV
D. Anti-HDV

正確答案：A. Anti-HAV